下列何者不是踝足部支架（AFO）最常見的使用適應症？
A. 腦傷合併小腿肌肉無力
B. 功能性扁平足
C. 腦部麻痺合併下肢痙攣
D. 腓神經受傷導致之垂足

正確答案：B. 功能性扁平足